Clinical trial exclusion criterion:
Presence of acute suicidality

Annotated entities:
- Condition: "acute suicidality"